Which cancer has the kynureninase pathway been associated to?

The kynurenine pathway has been associated with human glioma pathophysiology.